Clinical trial exclusion criterion:
A history of having inadequate response to adequate SSRIs or CBT treatment

Entity relations:
- AND("response", "SSRIs")
- Has_qualifier("response", "inadequate")
- OR("SSRIs", "CBT")